El gas empleado para generar el plasma ICP (plasma de inducción acoplado) es:
1. Hidrógeno por ser diatómico, químicamente inerte y con una baja energía de ionización.
2. Oxígeno por ser diatómico, altamente reactivo y con una elevada energía de ionización.
3. Argón, por ser monoatómico, químicamente inerte y con una elevada energía de ionización.
4. Xenón, por ser monoatómico, altamente reactivo y con una baja energía de ionización.
5. Ninguna de las anteriores es correcta, porque el gas utilizado es el helio.

Respuesta correcta: 3. Argón, por ser monoatómico, químicamente inerte y con una elevada energía de ionización.